Inability to discontinue oral anticoagulant 2-5 days prior to study treatment

The above is a clinical trial exclusion criterion. Annotated with entity spans:
[Non-query-able: Inability to discontinue oral anticoagulant 2-5 days prior to study treatment]